Current Moderate or Severe Substance Use Disorder, other than Alcohol, Nicotine or Caffeine Use Disorders

The above is a clinical trial exclusion criterion. Annotated with entity spans:
[Temporal: Current] [Qualifier: Moderate] or [Qualifier: Severe] [Condition: Substance Use Disorder], [Negation: other than] [Condition: Alcohol], [Condition: Nicotine] or [Condition: Caffeine Use Disorders]